血壓是判定傷病患是否呈現休克的重要指標，當災難事故發生時，若現場並無血壓量測工具時，可藉由橈動脈脈搏（radial  pulse）、股動脈脈搏（femoral pulse）及頸動脈脈搏（carotid pulse）之檢測，來估計傷病患之血壓高低。下列為當血壓低於 
 mmHg時，三種脈搏消失之先後次序，何者正確？
A. 股脈搏 → 頸脈搏 → 橈脈搏
B. 頸脈搏 → 股脈搏 → 橈脈搏
C. 橈脈搏 → 股脈搏 → 頸脈搏
D. 頸脈搏 → 橈脈搏 → 股脈搏

正確答案：C. 橈脈搏 → 股脈搏 → 頸脈搏